Clinical trial exclusion criterion:
Professional drivers, risk profession or respiratory failure (according to criteria of the clinical pathway for diagnosis and treatment of sleep-disordered breathing).

Entity relations:
- AND("respiratory failure", "criteria of the clinical pathway for diagnosis and treatment of sleep-disordered breathing")
- OR("Professional drivers", "respiratory failure", "risk profession")